一位 40 歲婦女哺乳結束後 1 個月，於其右側乳房發現一腫塊，mammography 發現為 3×3 公分 radiolucent and radiopaque combined oval lesion，則下列敘述何者錯誤？
A. oval lesion 通常是 benign lesion
B. oval lesion 通常是 malignant lesion
C. 最可能為 galactocele
D. aspiration 則可見濃稠黃色液體

正確答案：B. oval lesion 通常是 malignant lesion